Clinical trial exclusion criterion:
age less than 40 or over 80 years

Annotated entities:
- Person: "age"
- Value: "less than 40"
- Value: "over 80 years"